Clinical trial exclusion criterion:
Concomitant treatment by leflunomide, cidofovir, sirolimus, Millepertuis (Hypericum Perforatum)

Annotated entities:
- Temporal: "Concomitant"
- Drug: "leflunomide"
- Drug: "cidofovir"
- Drug: "sirolimus"
- Drug: "Millepertuis"
- Drug: "Hypericum Perforatum"